那一種利尿劑會抑制遠端彎曲小管（distal convoluted tubule）Na+/Cl - transporter而產生利尿作用？
A. acetazolamide
B. triamterene
C. thiazide
D. bumetanide

正確答案：C. thiazide